Clinical trial exclusion criterion:
sickle cell disease

Annotated entities:
- Condition: "sickle cell disease"